Clinical trial exclusion criterion:
Having experienced severe allergies, trauma history and/or operation history within 3 months;

Entity relations:
- Has_temporal("operation", "within 3 months")
- Has_temporal("trauma", "within 3 months")
- Has_temporal("severe allergies", "within 3 months")
- OR("severe allergies", "operation", "trauma")